List characteristics of Developmental and Epileptic Encephalopathies (DEEs).

Developmental and epileptic encephalopathies (DEEs) are a group of severe neurological disorders characterized by global developmental delay, contractures, refractory seizures, intractable seizures, epilepsy, facial dysmorphism, macrocephaly, cognitive deficits, autism, seizures, cerebellar dysgenesis, developmental delayed, behavioral abilities, developmental impairment or regression.